Clinical trial exclusion criterion:
PCOS or polycystic ovary on ultrasound scan.

Annotated entities:
- Condition: "PCOS"
- Condition: "polycystic ovary"
- Procedure: "ultrasound scan"